Clinical trial exclusion criterion:
History of angioedema to treatment with ACE inhibitors or ARBs

Entity relations:
- AND("treatment", "ACE inhibitors")
- AND("angioedema", "treatment")
- Has_temporal("angioedema", "History of")
- OR("ACE inhibitors", "ARBs")